Clinical trial exclusion criterion:
Subject has chronic obstructive pulmonary disease with detected pulmonary hypertension or any other evidence of significant lung disease.

Annotated entities:
- Condition: "chronic obstructive pulmonary disease"
- Condition: "pulmonary hypertension"
- Condition: "lung disease"
- Qualifier: "significant"